Current use of serotonergic drugs (triptans, certain tricyclic antidepressants, lithium, tramadol, St. John's Wort)

The above is a clinical trial exclusion criterion. Annotated with entity spans:
Current use of [Drug: serotonergic drugs] ([Drug: triptans], certain [Drug: tricyclic antidepressant]s, [Drug: lithium], [Drug: tramadol], [Drug: St. John's Wort])